Clinical trial exclusion criterion:
2. The subject has pre-existing sustained supine hypertension greater than 180mmHg systolic and 110mmHg diastolic BP or had these measurements at the Screening Visit. Sustained is defined as persistently greater at 2 separate measurements at least 5 minutes apart with the subject supine and at rest for the 5 minutes.

Annotated entities:
- Condition: "supine hypertension"
- Value: "greater than 180mmHg systolic"
- Value: "110mmHg diastolic"
- Measurement: "BP"
- Temporal: "at the Screening Visit"
- Reference_point: "Screening Visit"
- Temporal: "pre-existing"
- Temporal: "sustained"
- Temporal: "persistently"
- Value: "greater"
- Multiplier: "2 separate at least 5 minutes apart"
- Measurement: "measurements"